Clinical trial exclusion criterion:
Low or high amount of calcium in blood

Entity relations:
- Has_value("calcium in blood", "Low amount")
- OR("Low amount", "high amount")